Clinical trial inclusion criterion:
Adult participants with low or intermediate-1 risk MDS

Entity relations:
- Has_value("MDS", "low risk")
- OR("low risk", "intermediate-1 risk")